Patients being admitted to the hospital or those who are deemed too acutely ill for participation (triage level 1 or 2 or as determined by the ED patient care team) will be excluded from the study.

The above is a clinical trial exclusion criterion. Annotated with entity spans:
[Non-query-able: Patients being admitted to the hospital or those who are deemed too acutely ill for participation (triage level 1 or 2 or as determined by the ED patient care team) will be excluded from the study.]